Clinical trial exclusion criterion:
A previous adequate trial of topiramate

Entity relations:
- Has_temporal("topiramate", "previous")